History of deep vein thrombosis or pulmonary embolism or prostate cancer or heart failure (Class III and IV).

The above is a clinical trial exclusion criterion. Annotated with entity spans:
History of [Condition: deep vein thrombosis] or [Condition: pulmonary embolism] or [Condition: prostate cancer] or [Condition: heart failure] ([Qualifier: Class III] and IV).